Subject has symptomatic carotid stenosis.

The above is a clinical trial exclusion criterion. Annotated with entity spans:
Subject has [Qualifier: symptomatic] [Condition: carotid stenosis].